Clinical trial exclusion criterion:
Pregnant women, breast-feeding

Entity relations:
- OR("Pregnant", "breast-feeding")